常見於癌細胞組織中的腫瘤基因（oncogene）所轉譯之ErbB蛋白質，是經由下列那一個受體（receptor）的訊息傳導路徑而進行作用？
A. insulin receptor
B. platelet-derived growth factor（PDGF）receptor
C. epidermal growth factor（EGF）receptor
D. G-protein coupling receptor

正確答案：C. epidermal growth factor（EGF）receptor